Cuando una persona permanece en actitud inmóvil, con la musculatura rígida, y se le puede colocar en diversas posiciones sin que él intente recupera la posición original durante un tiempo, es probable que padezca:
1. Negativismo pasivo.
2. Obediencia automática.
3. Manierismos reactivos.
4. Alteración psicomotora de reposo.
5. Flexibilidad cérea.

Respuesta correcta: 5. Flexibilidad cérea.